在少量抗利尿激素分泌的情況下，下列那一段腎小管對水的通透性最小？
A. 近側腎曲小管
B. 皮質收集管
C. 亨利氏彎管上升支
D. 髓質收集管

正確答案：C. 亨利氏彎管上升支